Clinical trial exclusion criterion:
concomitant physical therapy

Entity relations:
- Has_temporal("physical therapy", "concomitant")